Which cells mature in the human thymus?

late stages of t cell maturation in the thymus involve nf-kb and tonic type i interferon signals